¿Cómo participa el cerebelo en el control del movimiento?:
1. Monitoriza la intención del movimiento.
2. Controla postura y equilibrio.
3. Compara el movimiento realizado con el previsto.
4. Envía señales de retroalimentación correctivas a las neuronas motoras de la corteza si es necesario.
5. Todas son correctas.

Respuesta correcta: 5. Todas son correctas.